At least one measurable lesion;

The above is a clinical trial inclusion criterion. Annotated with entity spans:
[Multiplier: At least one] measurable [Condition: lesion];